登革熱目前仍是台灣地區盛行的傳染病，有關登革熱病媒蚊之敘述，下列何者正確？
A. 雄蚊在白天吸血，雌蚊則在晚上吸血
B. 雌蚊喜好產卵於混濁不流動之污水中
C. 在台灣，傳播之病媒蚊種僅限於埃及斑蚊（Aedes aegypti）
D. 埃及斑蚊喜好在人類居家附近棲息

正確答案：D. 埃及斑蚊喜好在人類居家附近棲息